Mujer de 16 años que consulta por amenorrea primaria. Presenta un desarrollo femenino normal de los caracteres sexuales secundarios. Los niveles de estradiol y testosterona son normales. En la exploración ginecológica se aprecia agenesia de vagina. Se realiza ecografía y se aprecia ausencia de útero. Los ovarios son normales ecográficamente. No se observa riñón izquierdo. El diagnóstico más probable es:
1. Síndrome de Rokitanski.
2. Síndrome de Morris.
3. Hiperplasia suprarrenal congénita.
4. Síndrome de ovarios poliquísticos.
5. Síndrome de Kallman.

Respuesta correcta: 1. Síndrome de Rokitanski.